當膝關節由完全伸展開始屈曲時，下列何者先開始動作？
A. 股二頭肌（biceps femoris）
B. 膕肌（popliteus）
C. 腓腸肌（gastrocnemius）
D. 蹠肌（plantaris）

正確答案：B. 膕肌（popliteus）